Clinical trial inclusion criterion:
18 years of age

Entity relations:
- Has_value("age", "18 years")